Clinical trial exclusion criterion:
Any history of substance abuse (other than tobacco)

Entity relations:
- Has_negation("tobacco", "other")